Clinical trial inclusion criterion:
Positive HBeAg before starting NA treatment

Annotated entities:
- Measurement: "HBeAg"
- Value: "Positive"
- Temporal: "before starting NA treatment"
- Reference_point: "starting NA treatment"